Clinical trial exclusion criteria:
history of hypertension
known impaired renal function
liver disease
heart failure
myocardial infarction
coronary artery disease
smoked within the past year
apnea hypopnea index > 5 events per hour

Annotated entities:
- Condition: "hypertension"
- Temporal: "history"
- Condition: "impaired renal function"
- Condition: "liver disease"
- Condition: "heart failure"
- Condition: "myocardial infarction"
- Condition: "coronary artery disease"
- Observation: "smoked"
- Temporal: "within the past year"
- Measurement: "apnea hypopnea index"
- Value: "> 5 events per hour"